Clinical trial inclusion criterion:
planned decompression surgery with autologous stem cell transplant

Annotated entities:
- Procedure: "decompression surgery"
- Mood: "planned"
- Procedure: "autologous stem cell transplant"